Allergy to any of the drugs used in the study

The above is a clinical trial exclusion criterion. Annotated with entity spans:
[Condition: Allergy] to any of the [Drug: drugs used in the study]